下列有關台灣地區肝膿瘍的敘述，何者錯誤？
A. AIDS 患者易得阿米巴肝膿瘍
B. DM 患者易得化膿性肝膿瘍
C. 有不少轉移至眼球造成 endophthalmitis 的病案
D. 以革蘭氏陰氏菌，特別是腸內菌中的 E. coli 報告最多

正確答案：D. 以革蘭氏陰氏菌，特別是腸內菌中的 E. coli 報告最多